N2 可經由氮固化作用（nitrogen fixation）轉換成 ammonia，其所用到的兩個酵素為：
A. nitrate reductase, nitrite reductase
B. glutamate synthase, glutamate dehydrogenase
C. dihydrofolate reductase, methione synthase
D. nitrogenase, nitrogenase reductase

正確答案：D. nitrogenase, nitrogenase reductase